Clinical trial inclusion criterion:
2. Patients with at least 1 ≥50% stenosis in a coronary vessel, subjected to FFR assessment, who exhibit variation in Pd / Pa ratio ≥ 0.05 (e.g. difference of max Pd/Pa minus min Pd/Pa) during steady state hyperaemia (determined by visual assessment).

Annotated entities:
- Parsing_Error: "2."
- Multiplier: "at least 1"
- Value: "≥50%"
- Measurement: "stenosis in a coronary vessel"
- Procedure: "FFR assessment"
- Measurement: "Pd / Pa ratio"
- Value: "≥ 0.05"
- Measurement: "max Pd/Pa"
- Measurement: "min Pd/Pa"
- Condition: "hyperaemia"
- Qualifier: "steady state"
- Procedure: "visual assessment"
- Condition: "variation in Pd / Pa ratio"